Name the three phase 3, randomized, double-blind, placebo-controlled that assessed galcanezumab?

Galcanezumab has been assessed in the phase 3, randomized, double-blind, placebo-controlled EVOLVE-1, EVOLVE-2 and REGAIN studies.